Which deep learning framework has been developed for cancer molecular subtype classification?

The DeepCC framework is a novel deep learning-based framework for cancer molecular subtype classification.